Clinical trial exclusion criterion:
Contraindications for Magnetic resonance (MR) scanning such as persons with cardiac pacemaker and implants out of metal or claustrophobia

Entity relations:
- AND("Contraindications", "Magnetic resonance (MR) scanning")
- Subsumes("Contraindications", "cardiac pacemaker")
- OR("cardiac pacemaker", "implants out of metal", "claustrophobia")